Lucio’s Phenomenon is characteristic to which disease?

Lucio's phenomenon is a rare but distinctive skin eruption seen in patients with diffuse lepromatous leprosy.